¿Cuál es la finalidad del grupo ftalilo en el ftalilsulfatiazol?:
1. Mejorar la absorción intestinal.
2. Impedir la absorción intestinal.
3. Mejorar el paso a través de la barrera hematoencefálica.
4. Impedir el paso a través de la barrera hematoencefálica.
5. Aumentar la afinidad hacia la diana terapéutica del fármaco.

Respuesta correcta: 2. Impedir la absorción intestinal.